Clinical trial exclusion criterion:
Known major cognitive deficit dementia, history of head trauma with loss of consciousness >30 min, history of stroke, current central nervous system (CNS) disorder such as seizures or opportunistic CNS infection

Entity relations:
- AND("dementia", "cognitive deficit")
- Has_multiplier("loss of consciousness", ">30 min")
- AND("head trauma", "loss of consciousness")
- Subsumes("central nervous system disorder", "seizures")
- OR("seizures", "opportunistic CNS infection")
- OR("dementia", "head trauma", "central nervous system disorder", "stroke")